Clinical trial exclusion criterion:
vulnerable study subjects such as described in Finnish law concerning clinical studies (disabled, children, pregnant or breast-feeding women, prisoners) will not be included.

Entity relations:
- Has_qualifier("vulnerable", "Finnish law concerning clinical studies")
- Subsumes("vulnerable", "disabled")
- OR("disabled", "children", "pregnant", "breast-feeding", "women", "prisoners")